下列何者不是嚴重型子癇前症（severe preeclampsia）之指標？
A. 頭痛
B. 上腹痛
C. 視覺模糊
D. 多尿

正確答案：D. 多尿